List scales that are used for scoring of patients with spinal metastasis?

Tokuhashi, Tomita, Bauer, and Oswestry scores are used for survival prediction of patients with spinal metastases.